Pediatric facilities

The above is a clinical trial exclusion criterion. Annotated with entity spans:
[Visit: Pediatric facilities]